Hombre de 50 años, bronquítico crónico que ingresa por cuadro neumónico con hemocultivo positivo a Streptococcus pneumoniae, con una CMI a la penicilina de 0,0125 mg/l. Se inicia tratamiento con penicilina 2 millones cada 4 horas. Al quinto día sigue con fiebre de 38ºC. ¿Cuál de las siguientes decisiones le parece correcta?
1. Cambiaría el tratamiento a ceftriaxona por su mayor eficacia.
2. Añadiría al tratamiento una quinolona.
3. Cambiaría a amoxicilina / clavulánico.
4. Descartaría la presencia de un empiema pleural.
5. Seguiría con el mismo tratamiento, suponiendo que simplemente es un problema de tiempo.

Respuesta correcta: 4. Descartaría la presencia de un empiema pleural.